下列何者不在幽門平面（transpyloric plane）上？
A. 十二指腸空腸曲（duodenojejunal flexure）
B. 左右腎門（renal hilum）的連線
C. L1椎體（vertebral body of L1）
D. 脾門（splenic hilum）

正確答案：D. 脾門（splenic hilum）